癲癇合併智能不足常見於何種神經肌肉患者？
A. 裘馨氏肌肉失養症（Duchenne muscular dystrophy）
B. 脊髓肌肉萎縮症（spinal muscular atrophy）
C. 福山型先天性肌肉失養症（Fukuyama congenital muscular dystrophy）
D. 先天肌病（congenital myopathy）

正確答案：C. 福山型先天性肌肉失養症（Fukuyama congenital muscular dystrophy）